下列何者攜帶副交感節前神經纖維至耳神經節（otic ganglion）？
A. 鼓索神經（chorda tympani n.）
B. 大岩神經（greater petrosal n.）
C. 小岩神經（lesser petrosal n.）
D. 耳顳神經（auriculotemporal n.）

正確答案：C. 小岩神經（lesser petrosal n.）